Clinical trial exclusion criterion:
Hypersensitivity to everolimus, sirolimus, or other rapamycin deriviatives

Annotated entities:
- Condition: "Hypersensitivity"
- Drug: "everolimus"
- Drug: "sirolimus"
- Drug: "rapamycin"